Clinical trial inclusion criterion:
Creatinine clearance >30 milliliters/minute/1.73 centimeter squared

Annotated entities:
- Measurement: "Creatinine clearance"
- Value: ">30 milliliters/minute/1.73 centimeter squared"